Clinical trial inclusion criteria:
diabetic patient;
therapy with aspirin and insulin;
patient well responders

Annotated entities:
- Condition: "diabetic"
- Drug: "aspirin"
- Drug: "insulin"
- Condition: "well responders"